Cardiogenic shock.

The above is a clinical trial exclusion criterion. Annotated with entity spans:
[Condition: Cardiogenic shock].